Clinical trial exclusion criterion:
13. Use of concomitant drugs that prolong QT/QTc interval and/or are CYP3A4 inhibitors are prohibited with the exception of antibiotics, antifungals, and other antimicrobials that are used as standard of care to prevent or treat infections and other such drugs that are considered absolutely essential for the care of the patient.

Entity relations:
- multi("drugs that prolong QT/QTc interval", "that prolong QT/QTc interval")
- multi("that prolong QT/QTc interval", "prolong QT/QTc interval")
- Has_negation("antibiotics", "with the exception of")
- AND("drugs that prolong QT/QTc interval", "antibiotics")
- OR("antibiotics", "antifungals", "antimicrobials")
- OR("drugs that prolong QT/QTc interval", "CYP3A4 inhibitors")